teriflunomide; continuously for no less than 5 years.

The above is a clinical trial inclusion criterion. Annotated with entity spans:
[Drug: teriflunomide]; [Multiplier: continuously] [Temporal: for no less than 5 years].